王先生要出院的時候，跟住院醫師楊醫師表示希望影印整本的病歷供日後參考。楊醫師回答說不行，只能給他病歷摘要，你覺得根據醫療法楊醫師的回答正確嗎？
A. 正確，病人只能取得病歷摘要
B. 不正確，病人可以取得完整病歷複製本
C. 不正確，病人可以取得完整病歷原本
D. 正確，病人不能要求任何病歷

正確答案：B. 不正確，病人可以取得完整病歷複製本